¿Qué características aumentan la fiabilidad de la evaluación psicofisiológica?
1. La ley de los valores iniciales.
2. El balance autonómico y homeostasis.
3. La latencia y duración de las respuestas.
4. El control de artefactos ambientales y del organismo.
5. La reactividad.

Respuesta correcta: 4. El control de artefactos ambientales y del organismo.